Clinical trial exclusion criterion:
significant musculoskeletal or cardiopulmonary diseases;

Entity relations:
- Has_qualifier("musculoskeletal diseases", "significant")
- OR("musculoskeletal diseases", "cardiopulmonary diseases")